En el tratamiento de la insuficiencia cardiaca:
1. Los bloqueantes del receptor de la angiotensina (ARA II) han demostrado superioridad sobre los inhibidores de la enzima convertidora de angiotensina (IECA) y deberían ser la primera opción terapéutica.
2. Los antagonistas de la aldosterona no han demostrado mejoría pronóstica, estando contraindicados en pacientes con disfunción sistólica avanzada y grado funcional IV.
3. Los betabloqueantes han demostrado disminuir la mortalidad en pacientes con fracción de eyección disminuida.
4. La terapia mediante marcapasos de resincronización cardiaca está indicada en pacientes con disfunción sistólica siempre que el QRS sea estrecho (inferior a 120 msg).
5. El implante de desfibriladores automáticos está contraindicado en pacientes con disfunción ventricular, especialmente si es de causa isquémica.

Respuesta correcta: 3. Los betabloqueantes han demostrado disminuir la mortalidad en pacientes con fracción de eyección disminuida.